2. Healthy, premenopausal female age 18-47;

The above is a clinical trial inclusion criterion. Annotated with entity spans:
[Parsing_Error: 2.] [Condition: Healthy], [Condition: premenopausal] [Person: female] [Person: age] [Value: 18-47];